Clinical trial exclusion criterion:
Contracted bladder

Annotated entities:
- Condition: "Contracted bladder"